Clinical trial exclusion criterion:
allergies to medications used in the study

Annotated entities:
- Condition: "allergies"
- Drug: "medications"
- Qualifier: "used in the study"